一名69歲停經後女性，因陰道出血接受子宮內膜搔刮手術，病理報告顯示為類子宮內膜腺癌、細胞分化為第3級（grade 3），骨盆腔核磁共振檢查（MRI）發現疑有子宮深層肌肉層侵犯，下列敘述何者正確？
A. 患者宜接受剖腹探查手術，並切除子宮及雙側卵巢輸卵管
B. 患者宜接受剖腹探查手術，並切除子宮及雙側卵巢輸卵管，骨盆腔及主動脈旁淋巴結摘  	除，腹膜腔灌洗細胞學檢查
C. 抽菸，肥胖，多產次為這個疾病的危險因子
D. 患者疾病為第一型子宮內膜癌，常常和p53的基因突變有關

正確答案：B. 患者宜接受剖腹探查手術，並切除子宮及雙側卵巢輸卵管，骨盆腔及主動脈旁淋巴結摘  	除，腹膜腔灌洗細胞學檢查